Paciente de 45 años de edad en el 15º día postrasplante de progenitores hematopeyéticos, con una neutropenia absoluta, plaquetas de 15000/uL y una hemoglobina de 7 g/dL, que presenta un cuadro clínico de dolor ocular con edema periorbitario con discreta secreción nasal serosanguinolenta. ¿Cuál es el diagnóstico de presunción?
1. Hematoma periorbitario.
2. Reacción alérgica, posiblemente a la medicación.
3. Sinusitis aguda bacteriana, probablemente estafilocócica.
4. Sinusitis por Aspergillus spp.
5. Mucormicosis.

Respuesta correcta: 5. Mucormicosis.